aged 18-65 years old.

The above is a clinical trial inclusion criterion. Annotated with entity spans:
[Person: aged] [Value: 18-65 years old].